ALT < 10 x the upper limit of normal (ULN)

The above is a clinical trial inclusion criterion. Annotated with entity spans:
[Measurement: ALT] [Value: < 10 x the upper limit of normal (ULN)]